Clinical trial exclusion criterion:
has a history of food allergy

Annotated entities:
- Temporal: "history"
- Condition: "food allergy"